La selectividad en la apertura nucleófila que se produce en los oxaciclopropanos sustituidos se denomina:
1. Enantioselectividad.
2. Diastereoselectividad.
3. Regioselectividad.
4. Mesoselectividad
5. Ninguno de ellos.

Respuesta correcta: 3. Regioselectividad.